Clinical trial exclusion criterion:
evidence of psycological problem that may affect the capacity to understand the project and to comply with the medical recommandations

Annotated entities:
- Non-query-able: "evidence of psycological problem that may affect the capacity to understand the project and to comply with the medical recommandations"